Clinical trial inclusion criterion:
Patients should have been on non-steroidal anti-inflammatory drugs (NSAIDs) at the maximum tolerated dose for at least 4 weeks prior to their Baseline Visit, with an inadequate response or for less than 4 weeks if withdrawn for intolerance, toxicity or contraindications

Entity relations:
- Has_index("for at least 4 weeks prior to their Baseline Visit", "their Baseline Visit")
- Has_multiplier("non-steroidal anti-inflammatory drugs (NSAIDs)", "maximum tolerated dose")
- Has_temporal("non-steroidal anti-inflammatory drugs (NSAIDs)", "for at least 4 weeks prior to their Baseline Visit")
- Has_temporal("inadequate response", "for less than 4 weeks")
- AND("withdrawn for intolerance", "inadequate response")
- OR("withdrawn for intolerance", "contraindications", "withdrawn for toxicity")